>= 18 years old the day of inclusion

The above is a clinical trial inclusion criterion. Annotated with entity spans:
[Value: >= 18 years] [Person: old] the day of inclusion